Clinical trial inclusion criterion:
45y or older

Annotated entities:
- Value: "45 or older"
- Person: "y"